Clinical trial exclusion criterion:
Recent (within 6 weeks) or planned dental or jaw surgery (e.g. extraction, implants)

Entity relations:
- Subsumes("Recent", "within 6 weeks")
- Subsumes("dental surgery", "extraction")
- Has_temporal("dental surgery", "Recent")
- OR("dental surgery", "jaw surgery")
- OR("extraction", "implants")
- OR("Recent", "planned")